What is particular about the mouse Fxy gene's chromosomal position?

The mouse fxy gene spans the pseudoautosomal boundary in mice such that the first three exons of the gene are located on the x chromosome, but the remainder is located on both x and y chromosomes.